Clinical trial exclusion criterion:
Conversion to open laparotomy from laparoscopic surgery

Annotated entities:
- Observation: "Conversion"
- Procedure: "open laparotomy"
- Procedure: "laparoscopic surgery"